Clinical trial exclusion criteria:
age <18 years
previous history of roux-en-y gastric bypass
patients undergoing other bariatric procedures
pre-operative opioid analgesics

Annotated entities:
- Person: "age"
- Value: "<18 years"
- Temporal: "history"
- Procedure: "roux-en-y gastric bypass"
- Temporal: "previous"
- Procedure: "bariatric procedures"
- Qualifier: "other"
- Temporal: "undergoing"
- Temporal: "pre-operative"
- Drug: "opioid analgesics"